Clinical trial exclusion criterion:
History or known presence of systemic autoimmune disorders potentially causing progressive neurologic disease (e.g., lupus, anti-phospholipid antibody syndrome, Sjogren's syndrome, Behçet's disease, sarcoidosis)

Entity relations:
- Has_mood("progressive neurologic disease", "potentially causing")
- AND("systemic autoimmune disorders", "progressive neurologic disease")
- Subsumes("systemic autoimmune disorders", "lupus")
- Has_temporal("systemic autoimmune disorders", "History")
- OR("lupus", "Behçet's disease", "sarcoidosis", "Sjogren's syndrome", "anti-phospholipid antibody syndrome")